下列有關哺餵母奶的敘述，何者錯誤？
A. 哺餵母奶嬰兒之糞便較軟較稀
B. 哺餵母奶應該每四小時規律的餵食
C. B 型肝炎帶原母親仍可哺餵母奶
D. 哺餵母奶的嬰兒也需於出生後給予一劑維生素K1

正確答案：B. 哺餵母奶應該每四小時規律的餵食